上眼部化學灼傷（chemical burn）時，急救的第一步是什麼？
A. 眼睛包紮
B. 趕緊送到醫院
C. 馬上以清水沖洗眼部
D. 立刻投予類固醇藥物

正確答案：C. 馬上以清水沖洗眼部